Clinical trial inclusion criterion:
older than 18 years (of both sexes)

Entity relations:
- Has_value("years", "older than 18")